Clinical trial exclusion criterion:
Has a chronic illness (e.g., liver or kidney disease), receiving a concomitant therapy or have any other condition that could interfere with the subject's participation in the study or in the interpretation of the study results

Annotated entities:
- Condition: "chronic illness"
- Undefined_semantics: "chronic illness"
- Condition: "liver disease"
- Condition: "kidney disease"
- Procedure: "therapy"
- Temporal: "concomitant"
- Undefined_semantics: "therapy"
- Condition: "any other condition"
- Qualifier: "could interfere with the subject's participation in the study"